Clinical trial exclusion criterion:
A history of cataract surgery complications/vitreous loss in the study eye.

Annotated entities:
- Temporal: "history of"
- Procedure: "cataract surgery"
- Condition: "cataract surgery complications"
- Condition: "vitreous loss"
- Qualifier: "in the study eye"